36歲油漆工林先生，身體一向健康，10天前罹患輕微感冒，而5天來出現漸進性四肢無力，肢體末端略感麻木，稍覺呼吸急促，但神智清楚，也無吞嚥困難或口齒不清的狀況，因此至門診求助。林先生最可能罹患下列何種疾病？
A. 重症肌無力症（myasthenia gravis）
B. 多發性肌炎（polymyositis）
C. 急性發炎性脫髓鞘多發性神經病變症候群（Guillain-Barré syndrome）
D. 腦幹中風

正確答案：C. 急性發炎性脫髓鞘多發性神經病變症候群（Guillain-Barré syndrome）